Clinical trial inclusion criterion:
Borg dyspnea score > 3 during the 3-min constant rate shuttle walking test at V3

Entity relations:
- Has_qualifier("3-min constant rate shuttle walking test", "V3")
- Has_value("Borg dyspnea score", "> 3")
- Has_temporal("Borg dyspnea score", "3-min constant rate shuttle walking test")